Clinical trial exclusion criterion:
Patients with known or suspected heparin induced thrombocytopenia prior to consent

Entity relations:
- Has_index("prior to consent", "consent")
- Has_temporal("thrombocytopenia", "prior to consent")
- multi("heparin induced", "heparin")
- Has_qualifier("thrombocytopenia", "heparin induced")
- Has_mood("thrombocytopenia", "known")
- OR("known", "suspected")